Clinical trial exclusion criterion:
Contraindication for hepatectomy, including gastrointestinal hemorrhage, severe hemorrhagic disorders, explicit acute nonspecific infectious lesion, overt ascites, Child-Pugh Score C, indocyanine green retention rate at 15min (ICGR15)＞30%(12), serum hepatitis B virus (HBV)-DNA＞126 copies/ml and serum alanine aminotransferase (ALT) ＞ 2×ULN, serum triglycerides＞2.0 mmol/L, circulatory shock, stroke, acute myocardial infarction, renal failure, coma of unknown cause

Annotated entities:
- Condition: "Contraindication for hepatectomy"
- Condition: "gastrointestinal hemorrhage"
- Condition: "hemorrhagic disorders"
- Qualifier: "severe"
- Condition: "infectious lesion"
- Qualifier: "nonspecific"
- Temporal: "acute"
- Condition: "ascites"
- Qualifier: "overt"
- Measurement: "Child-Pugh Score"
- Value: "C"
- Measurement: "indocyanine green retention rate at 15min (ICGR15)"
- Value: "＞30%"
- Measurement: "serum hepatitis B virus (HBV)-DNA"
- Value: "＞126 copies/ml"
- Measurement: "serum alanine aminotransferase (ALT)"
- Value: "＞ 2×ULN"
- Measurement: "serum triglycerides"
- Value: "＞2.0 mmol/L"
- Condition: "circulatory shock"
- Condition: "stroke"
- Condition: "acute myocardial infarction"
- Condition: "renal failure"
- Condition: "coma"
- Qualifier: "unknown cause"
- Procedure: "hepatectomy"